一位 1 歲 6 個月大的孩子，於 11 個月大時因為得到川崎病（Kawasaki disease）接受高劑量靜脈注射免疫球蛋白治療。目前下列那一種疫苗不宜接種，以免影響此疫苗效果？
A. 流感疫苗
B. 日本腦炎疫苗
C. 麻疹、腮腺炎、德國麻疹（MMR）三合一疫苗
D. 白喉、百日咳、破傷風、b 型嗜血桿菌、小兒麻痺五合一疫苗

正確答案：C. 麻疹、腮腺炎、德國麻疹（MMR）三合一疫苗